Clinical trial exclusion criterion:
Food allergies (other than controlled Coeliac Disease)

Entity relations:
- Has_negation("Coeliac Disease", "other")